The patient has received prior surgery for primary tumor or lymph node ( except for biopsy )

The above is a clinical trial exclusion criterion. Annotated with entity spans:
The patient has received [Temporal: prior] [Procedure: surgery] for [Qualifier: primary] [Condition: tumor] or [Condition: lymph node] ( [Negation: except for] [Procedure: biopsy] )